Clinical trial exclusion criterion:
Prior treatment with enzalutamide or abiraterone acetate for > 14 days prior to enrollment and completion of baseline tests.

Entity relations:
- Has_index("prior to enrollment", "enrollment")
- AND("treatment", "enzalutamide")
- Has_multiplier("treatment", "for > 14 days")
- Has_temporal("treatment", "prior to enrollment")
- OR("enzalutamide", "abiraterone acetate")